在動物細胞內，下列何者為葡萄糖進行無氧糖解（anaerobic glycolysis）之淨產物？
A. ATP和pyruvate
B. ATP和lactate
C. NAD+和ethanol
D. ATP和acetyl-CoA

正確答案：B. ATP和lactate